Patients who are on cyclosporine, bosentan, or potassium sparing diuretic.

The above is a clinical trial exclusion criterion. Annotated with entity spans:
Patients who are on [Drug: cyclosporine], [Drug: bosentan], or [Drug: potassium sparing diuretic].